Clinical trial inclusion criterion:
Methadone-maintained cocaine-dependent patients use between 1g to 2g a day; 1 to 3 times a week

Entity relations:
- multi("Methadone-maintained", "Methadone")
- Has_qualifier("cocaine-dependent", "Methadone-maintained")
- Has_multiplier("Methadone", "1g to 2g a day")
- Has_multiplier("Methadone", "1 to 3 times a week")